Infiltration or previous surgery in the area

The above is a clinical trial exclusion criterion. Annotated with entity spans:
[Condition: Infiltration] or [Procedure: previous surgery] in the area